Inmediatamente después de la decapsidación del virus herpes tiene lugar la:
1. Síntesis de una RNA polimerasa propia.
2. Circularización de su genoma.
3. Lisis del endosoma.
4. Transcripción de la DNA polimerasa vírica.
5. Síntesis de una proteína inhibidora de la replicación de la célula huésped.

Respuesta correcta: 2. Circularización de su genoma.